Clinical trial inclusion criteria:
Capacity to provide informed consent before any trial-related activities
Established T2DM (=3months)
HbA1c = 9% if on triple therapy or = 10% on diet & exercise or monotherapy or dual therapy
Current glucose lowering therapy either mono, dual or triple of any combination of metformin, sulphonylurea, DPP-IV inhibitor, GLP-1 therapy or an SGLT2 +/- diet and exercise
Poorly managed diet controlled diabetes (with HbA1c > 6.5% , not currently taking any glucose lowering therapy, meeting BMI inclusion range)
Body mass index > 30Kg/m2 or > 27.5 Kg/m2 (South Asian),
Diagnosis of T2DM before the age of 60 years of age
Age =18 and = 65 years

Annotated entities:
- Informed_consent: "Capacity to provide informed consent before any trial-related activities"
- Measurement: "Capacity to provide informed consent before any trial-related activities"
- Condition: "T2DM"
- Temporal: "=3months"
- Measurement: "HbA1c"
- Value: "= 9%"
- Value: "= 10%"
- Procedure: "glucose lowering therapy"
- Drug: "metformin"
- Drug: "sulphonylurea"
- Drug: "DPP-IV inhibitor,"
- Drug: "GLP-1 therapy"
- Drug: "SGLT2"
- Observation: "diet"
- Observation: "exercise"
- Condition: "diabetes"
- Measurement: "HbA1c"
- Value: "> 6.5%"
- Negation: "not"
- Procedure: "glucose lowering therapy"
- Measurement: "Body mass index"
- Value: "> 30Kg/m2"
- Value: "> 27.5 Kg/m2"
- Condition: "T2DM"
- Person: "age"
- Value: "before 60 years of age"
- Person: "Age"
- Value: "=18 and = 65 years"